Clinical trial exclusion criterion:
Received more than one primary chemotherapy regimen.

Entity relations:
- Has_multiplier("primary chemotherapy regimen", "more than one")